Clinical trial exclusion criterion:
moderate-to-severe depression (> 25 points on the Beck Depression Inventory)

Entity relations:
- Has_qualifier("depression", "moderate-to-severe")
- Has_value("Beck Depression Inventory", "> 25 points")